Clinical trial inclusion criterion:
Willing to attend study sessions and follow other study protocol

Annotated entities:
- Post-eligibility: "Willing to attend study sessions and follow other study protocol"